Clinical trial inclusion criterion:
Greater than 34 weeks gestation

Annotated entities:
- Condition: "gestation"
- Value: "Greater than 34 weeks"